Clinical trial exclusion criterion:
Patients with hepatic impairment (child-Pugh staging, calibration = 5) or renal impairment (creatinine clearance = 30ml / min), recent peptic ulcer, a history of hypersensitivity to cilostazol, cancer patients undergoing treatment.

Entity relations:
- Has_value("child-Pugh staging", "calibration = 5")
- Subsumes("hepatic impairment", "child-Pugh staging")
- Has_value("creatinine clearance", "= 30ml / min")
- Subsumes("renal impairment", "creatinine clearance")
- Has_temporal("peptic ulcer", "recent")
- AND("cancer", "treatment")
- AND("hypersensitivity", "cilostazol")
- Has_temporal("hypersensitivity", "history of")
- OR("hepatic impairment", "renal impairment", "hypersensitivity", "cancer", "peptic ulcer")